Subject is pregnant (documented by a positive pregnancy test) or is actively breast-feeding.

The above is a clinical trial exclusion criterion. Annotated with entity spans:
Subject is [Condition: pregnant] (documented by a [Value: positive] [Measurement: pregnancy test]) or is [Qualifier: actively] [Observation: breast-feeding].